Clinical trial inclusion criteria:
adult patients aged = 55 years with
a radiographically confirmed hip fracture

Annotated entities:
- Person: "adult"
- Person: "aged"
- Value: "= 55 years"
- Condition: "hip fracture"
- Procedure: "radiographically"